La cromatina es:
1. Característica de células procariotas.
2. Característica de células eucariotas.
3. Lo que queda al extraer el DNA de los cromosomas.
4. Lo que queda al extraer las proteínas de los cromosomas.

Respuesta correcta: 2. Característica de células eucariotas.